Clinical trial exclusion criterion:
hormonal contraception

Annotated entities:
- Procedure: "hormonal contraception"